Indica cuál de los siguientes trastornos es una enfermedad lisosomal:
1. Déficit de GLUT2.
2. Déficit de HSL (lipasa sensible a las hormonas).
3. Déficit de LPL (lipoproteína lipasa).
4. Déficit de transportadores de aminoácidos básicos.
5. Mucopolisacaridosis.

Respuesta correcta: 5. Mucopolisacaridosis.